下列有關 mifepristone（RU-486）的藥理作用描述，何者錯誤？
A. 為一種具選擇性糖皮質激素受體拮抗劑（glucocorticoid receptor antagonist）
B. 具有高度的抗孕激素活性（antiprogestin activity）作用，因此可以被用來當作一種避孕劑
C. 會惡化庫欣氏症候群（Cushing's syndrome）的臨床症狀
D. 口服有效

正確答案：C. 會惡化庫欣氏症候群（Cushing's syndrome）的臨床症狀